下列有關慢性阻塞性肺病之敘述，何者錯誤？
A. 基本上是屬於不可逆的氣道阻塞性疾病，無法治癒
B. 主要為氣道炎症反應，參與發炎之細胞主要為淋巴球與嗜酸性白血球
C. 主要的病因為吸菸，罹病者 90%為吸菸或曾經吸菸者
D. 影響病人預後的主要決定因子為病人的肺功能（FEV1）

正確答案：B. 主要為氣道炎症反應，參與發炎之細胞主要為淋巴球與嗜酸性白血球